Clinical trial exclusion criterion:
Severe gravidic disease present at inclusion involving life threatening to the mother and/or the child

Entity relations:
- Has_qualifier("gravidic disease", "Severe")
- Has_qualifier("gravidic disease", "life threatening")